Por reacción de carbonilos con amina primarias y secundarias se obtienen:
1. Iminas y oximas.
2. Iminas y enaminas.
3. Oxazonas e hidrazonas.
4. Semicarbazonas y nitronas.
5. Ninguna de las anteriores.

Respuesta correcta: 2. Iminas y enaminas.